Clinical trial inclusion criterion:
Fasting blood glucose 100-125 mg/dL

Entity relations:
- Has_value("Fasting blood glucose", "100-125 mg/dL")